隔壁老王回山東老家探親，回來後開始腹瀉、發燒、貧血、並伴有肝脾腫大，髂骨穿刺在骨髓巨噬細胞中發現無鞭毛體（amastigotes），血液及糞便檢查沒有其他發現，老王沒去過台灣及山東以外其他地方，他最可能感染的寄生蟲病是：
A. 黑熱病
B. 間日瘧
C. 日本血吸蟲症
D. 恰氏症（Chagas' disease）

正確答案：A. 黑熱病